history of uveitis

The above is a clinical trial exclusion criterion. Annotated with entity spans:
[Temporal: history] of [Condition: uveitis]